Clinical trial inclusion criterion:
With good oral hygiene;

Annotated entities:
- Observation: "good oral hygiene"